Global myocardial perfusion reserve (MPR) index < 2.5

The above is a clinical trial inclusion criterion. Annotated with entity spans:
[Measurement: Global myocardial perfusion reserve (MPR) index] [Value: < 2.5]